Preoperative opioid use

The above is a clinical trial exclusion criterion. Annotated with entity spans:
[Temporal: Preoperative] [Drug: opioid] use